關於分枝桿菌（Mycobacteria）之敘述，下列何者正確？
A. 堪薩斯分枝桿菌（Mycobacterium kansasii ）為非致病之正常菌叢
B. 鳥型分枝桿菌（Mycobacterium avium）常見於感染愛滋病病人
C. 海洋分枝桿菌（Mycobacterium marinum）不會造成人類感染
D. 牛型分枝桿菌（Mycobacterium bovis）非人類致病菌

正確答案：B. 鳥型分枝桿菌（Mycobacterium avium）常見於感染愛滋病病人